Clinical trial inclusion criterion:
Decline physical function (walking speed < 1 m/s) Group 3 (Either or both)

Annotated entities:
- Condition: "Decline physical function"
- Measurement: "walking speed"
- Value: "< 1 m/s"
- Non-representable: "Group 3 (Either or both)"